Clinical trial exclusion criterion:
Previous allergy reactions to progesterone products

Entity relations:
- AND("allergy", "progesterone products")